What is a coligo?

Coligos are circularized oligodeoxynucleotides